Clinical trial inclusion criterion:
White blood cell count, platelet, hematocrit, tuberculosis, aspartate aminotransferase (AST), alanine aminotransferase (ALT), alkaline phosphatase, creatinine, and HIV test results reviewed by transplant center

Annotated entities:
- Measurement: "White blood cell count"
- Measurement: "platelet"
- Measurement: "hematocrit"
- Measurement: "tuberculosis"
- Measurement: "aspartate aminotransferase (AST)"
- Measurement: "alanine aminotransferase (ALT)"
- Measurement: "alkaline phosphatase"
- Measurement: "creatinine"
- Measurement: "HIV test results"
- Qualifier: "reviewed by transplant center"